下列有關惡性軟組織腫瘤之敘述，何者最正確？
A. 滑液囊肉瘤（synovial sarcoma）是指從滑液囊細胞（synovium）分化而成的腫瘤，常見於關節附近
B. 透明細胞肉瘤（clear cell sarcoma）在組織學上可見到兩相形式（biphasic pattern），包  	括柱狀細胞及梭狀細胞
C. 惡性脂肪肉瘤（liposarcoma）好發於後腹腔、大腿、臀部
D. 在磁振攝影下呈現異形性腫塊（heterogenous mass）， 可利用此特徵來分辨是良性還是惡性腫瘤

正確答案：C. 惡性脂肪肉瘤（liposarcoma）好發於後腹腔、大腿、臀部